Clinical trial exclusion criterion:
Use of immunoglobulin in the past 12 months before the study vaccination;

Entity relations:
- Has_index("in the past 12 months before the study vaccination", "the study vaccination")
- Has_temporal("immunoglobulin", "in the past 12 months before the study vaccination")